Valvular Heart Disease including those with prosthetic valve, mitral stenosis (moderate to severe) or valve repair.

The above is a clinical trial exclusion criterion. Annotated with entity spans:
[Condition: Valvular Heart Disease] including those with [Device: prosthetic valve], [Condition: mitral stenosis] ([Qualifier: moderate] to [Qualifier: severe]) or [Procedure: valve repair].